El espacio muerto anatómico:
1. Es siempre mayor que el fisiológico.
2. Secreta surfactantes.
3. Incluye bronquiolos de mediano calibre.
4. Permite intercambio gaseoso.
5. Incluye el volumen de reserva inspiratoria.

Respuesta correcta: 3. Incluye bronquiolos de mediano calibre.